Clinical trial inclusion criterion:
Life expectancy >12 weeks

Entity relations:
- Has_value("Life expectancy", ">12 weeks")